Clinical trial exclusion criterion:
History of clinically-significant drug allergy to nucleoside/nucleotide analogs.

Annotated entities:
- Condition: "drug allergy"
- Qualifier: "clinically-significant"
- Drug: "nucleoside"
- Drug: "nucleotide analogs"